有關肺炎鏈球菌（Streptococcus pneumoniae）的敘述，下列何者錯誤？
A. 在血液培養盤上菌落周圍，呈現草綠色的溶血環
B. 具抗吞噬的能力的莢膜（capsule）是此菌重要的致病因子
C. 具group C多醣類，可與C-反應蛋白質（C-reactive protein, CRP）發生反應
D. 對奧普托辛（optochin）敏感，且可被膽汁溶解

正確答案：C. 具group C多醣類，可與C-反應蛋白質（C-reactive protein, CRP）發生反應